一位 38 歲肥胖女性，不正常陰道點狀出血長達 6 個月。10 年前因為月經不規則就醫，被診斷為多囊性卵巢症候群，不曾服用藥物治療。驗孕反應為陰性。超音波檢查發現子宮內膜增厚。下列何種檢查最適當？
A. 2-hour glucose tolerance test
B. glucose/insulin ratio
C. LH / FSH ratio
D. 子宮內膜採樣

正確答案：D. 子宮內膜採樣